Normal cognitive status according to MiniCog

The above is a clinical trial inclusion criterion. Annotated with entity spans:
[Condition: Normal cognitive status] according to [Procedure: MiniCog]